Clinical trial inclusion criterion:
women undergoing IVF/ICSI or frozen embryo transfers (FET) that less than 40 years old.

Annotated entities:
- Person: "women"
- Procedure: "IVF"
- Procedure: "ICSI"
- Procedure: "frozen embryo transfers (FET)"
- Value: "less than 40 years"
- Person: "old"